Clinical trial exclusion criteria:
Serum phosphate <3.0 mg/dL
Intravenous (IV) iron administered within 4 weeks prior to Screening
Erythropoiesis-stimulating agents (ESA) administered within 4 weeks prior to Screening
Blood transfusion within 4 weeks prior to Screening

Annotated entities:
- Measurement: "Serum phosphate"
- Value: "<3.0 mg/dL"
- Drug: "iron"
- Qualifier: "IV"
- Qualifier: "Intravenous"
- Temporal: "within 4 weeks prior to Screening"
- Reference_point: "Screening"
- Drug: "Erythropoiesis-stimulating agents"
- Drug: "ESA"
- Temporal: "within 4 weeks prior to Screening"
- Reference_point: "Screening"
- Procedure: "Blood transfusion"
- Temporal: "within 4 weeks prior to Screening"
- Reference_point: "Screening"